History of atypical cholinesterase (CP is metabolized by cholinesterase)

The above is a clinical trial exclusion criterion. Annotated with entity spans:
[Temporal: History] of [Drug: atypical cholinesterase] ([Non-representable: CP is metabolized by cholinesterase])